一位 16 歲男性病患出現發燒、咳嗽少痰、頭痛及全身倦怠五天，胸部 X 光片出現左下肺葉浸潤。住院後，醫師給予第二代 cephalosporin 治療五天，發燒持續，咳嗽稍有改善，胸部 X 光片無明顯進步，病人皮膚出現 erythema multiforme major 病變。痰液檢查呈現 Gram(+) Cocci，PMNs > 25，squamous epithelial cells > 10（X100 magnification）。血清 cold agglutinins titer 為 1：32 positive，下列敘述何者錯誤？
A. 應該更換 antibiotic 為第三代 β-lactam 藥物
B. 皮膚的病變可能由產生 pneumonia 的 pathogen 所引起
C. sputum Gram's stain 出現 Gram(+) Cocci，可能是病人口腔內的 colonized flora
D. 病毒感染例如 cytomegalovirus, Epstein-Barr virus，也會引起 cold agglutinins titer 增高

正確答案：A. 應該更換 antibiotic 為第三代 β-lactam 藥物